Clinical trial exclusion criterion:
recent thrombotic event

Entity relations:
- Has_temporal("thrombotic event", "recent")